current use of sedatives or antidepressant.

The above is a clinical trial exclusion criterion. Annotated with entity spans:
[Temporal: current] use of [Drug: sedatives] or [Drug: antidepressant].